Patients with a history of stroke or an acute cardiovascular event over the previous 12 months.

The above is a clinical trial exclusion criterion. Annotated with entity spans:
Patients with a history of [Condition: stroke] or an [Procedure: acute cardiovascular event] [Temporal: over the previous 12 months].